下列何者不是腎臟分泌的？
A. 紅血球生成素（erythropoietin）
B. 腎素（renin）
C. 鈣三醇（calcitriol）
D. 醛固酮（aldosterone）

正確答案：D. 醛固酮（aldosterone）